Clinical trial exclusion criterion:
3. Patients have been diagnosed with cancer of the liver

Annotated entities:
- Condition: "cancer of the liver"